Clinical trial inclusion criterion:
Subjects must be capable of providing signed and dated written informed consent by date of Visit 0 (-2 week).

Annotated entities:
- Informed_consent: "Subjects must be capable of providing signed and dated written informed consent by date of Visit 0 (-2 week)."